Clinical trial inclusion criterion:
Hemoglobin: ≥ 9 g/dL

Entity relations:
- Has_value("Hemoglobin", "≥ 9 g/dL")